Which syndrome is caused by dysfunction of the ciliary ARMC9/TOGARAM1 protein?

Joubert syndrome (JBTS) is a recessive neurodevelopmental disorder caused by dysfunction of the ciliary ARMC9/TOGARAM1 protein.